¿Cómo se denomina el procedimiento de condicionamiento instrumental en el que la respuesta instrumental elimina o previene la ocurrencia de un estímulo aversivo?:
1. Reforzamiento positivo.
2. Castigo.
3. Reforzamiento negativo.
4. Omisión.
5. Extinción.

Respuesta correcta: 3. Reforzamiento negativo.